下列何者和下副甲狀腺（inferior parathyroid gland）有相同的胚胎起源？
A. 甲狀腺（thyroid gland）
B. 頸竇（cervical sinus）
C. 氣管（trachea）
D. 胸腺（thymus）

正確答案：D. 胸腺（thymus）